Clinical trial inclusion criterion:
Adult patient (male or female) requiring emergency endotracheal intubation.

Entity relations:
- OR("male", "female")